Any other confounding bladder or urethral pathology, including urethral stricture, bladder neck contracture, or bladder atonia

The above is a clinical trial exclusion criterion. Annotated with entity spans:
Any other confounding [Condition: bladder] or [Condition: urethral pathology], including [Condition: urethral stricture], [Condition: bladder neck contracture], or [Condition: bladder atonia]